Un electrodo selectivo de Oxígeno o electrodo de Clark se caracteriza por:
1. Tener un fundamento amperométrico.
2. Tener un fundamento potenciométrico.
3. Tener un electrodo interno de pH.
4. Tener un electrodo de referencia interno.

Respuesta correcta: 1. Tener un fundamento amperométrico.